Clinical trial inclusion criterion:
Previous diagnoses of COPD and HF under optimized clinical treatment as judged by the accompanying physician

Entity relations:
- Has_qualifier("clinical treatment", "optimized")
- AND("COPD", "clinical treatment")
- OR("COPD", "HF")